What is the link between Dax1 and Esrrb?

Dax1 associates with Esrrb and regulates its function in embryonic stem cells.